Clinical trial exclusion criteria:
Any active respiratory, cardiovascular or other disease requiring regular treatment or being otherwise relevant for tolerance of hypoxia or altitude exposure.
Any condition that may interfere with protocol compliance including current heavy smoking (>20 cigarettes per day or >20 pack-years with active smoking during the last 10 years), regular use of alcohol.
Allergy to acetazolamide and other sulfonamides.

Annotated entities:
- Condition: "respiratory disease"
- Condition: "cardiovascular disease"
- Condition: "disease"
- Qualifier: "other"
- Qualifier: "active"
- Procedure: "treatment"
- Qualifier: "regular"
- Condition: "tolerance"
- Condition: "hypoxia"
- Mood: "relevant for"
- Observation: "altitude exposure"
- Non-query-able: "Any condition that may interfere with protocol compliance including current heavy smoking (>20 cigarettes per day or >20 pack-years with active smoking during the last 10 years), regular use of alcohol"
- Condition: "Allergy"
- Drug: "acetazolamide"
- Drug: "sulfonamides"